Clinical trial exclusion criterion:
Expected life expectancy < 1 year

Entity relations:
- Has_value("Expected life expectancy", "< 1 year")